Clinical trial exclusion criterion:
Uncontrolled narrow-angle glaucoma

Annotated entities:
- Condition: "narrow-angle glaucoma"
- Qualifier: "Uncontrolled"